動脈硬化斑塊（atheromatous plaques）常見特徵為：
A. 內膜（tunica intima）有許多平滑肌細胞增生
B. 中膜（tunica media）有許多彈性板（elastic lamellae）出現
C. 外膜（tunica adventitia）顯	變厚
D. 三層構造均有顯	的平滑肌細胞增生、脂質（lipid）堆積和膠原蛋白（collagen）大量合成

正確答案：A. 內膜（tunica intima）有許多平滑肌細胞增生